Clinical trial exclusion criterion:
Metabolic or hormonal abnormalities.

Entity relations:
- OR("Metabolic abnormalities", "hormonal abnormalities")